提腭帆肌（levator veli palatini）由何神經支配？
A. 第五顱神經第三支
B. 第七顱神經
C. 舌咽神經（glossopharyngeal nerve）
D. 副神經（accessory nerve）之顱根（cranial root），轉經迷走神經（vagus nerve）

正確答案：D. 副神經（accessory nerve）之顱根（cranial root），轉經迷走神經（vagus nerve）